Clinical trial exclusion criterion:
HYPERTENSIVE: known cardiovascular disease or risk factors aside from hypertension or use of cardiac medications

Annotated entities:
- Condition: "HYPERTENSIVE"
- Condition: "cardiovascular disease"
- Condition: "cardiovascular risk factors"
- Condition: "cardiovascular risk factors from hypertension"
- Negation: "aside from"
- Drug: "cardiac medications"